Hematologic ANC > 1000/uL and platelet > 75,000/uL,

The above is a clinical trial inclusion criterion. Annotated with entity spans:
[Measurement: Hematologic ANC] [Value: > 1000/uL] and [Measurement: platelet] [Value: > 75,000/uL],